Clinical trial exclusion criterion:
Malignancies (<5 years)

Annotated entities:
- Condition: "Malignancies"
- Temporal: "<5 years"